Children with written informed consent from parent/guardian.

The above is a clinical trial inclusion criterion. Annotated with entity spans:
[Informed_consent: Children with written informed consent from parent/guardian].